Clinical trial exclusion criterion:
Recipient or donor is known to be seropositive for human immunodeficiency virus (HIV)

Annotated entities:
- Measurement: "human immunodeficiency virus"
- Value: "seropositive"
- Measurement: "HIV"
- Person: "Recipient"
- Person: "donor"